What is the rate of epimutations in C. elegans?

In C. elegans epimutations arise spontaneously at a rate approximately 25 times greater than DNA sequence changes.